Has read, understood and signed the information consent letter.

The above is a clinical trial inclusion criterion. Annotated with entity spans:
[Post-eligibility: Has read, understood and signed the information consent letter.]